疱疹後神經痛（postherpetic neuralgia）最常出現於下列何處皮節（dermatome）？
A. 胸部
B. 頸部
C. 腰部
D. 薦部

正確答案：A. 胸部